¿Cuál es el mecanismo de acción del fluconazol?:
1. Inhibe la síntesis de ácidos nucleicos.
2. Interfier en la formación de 1-3 β glucanos de la pared celular.
3. Bloquea la síntesis de ergosterol.
4. Altera la permeabilidad de la membrana celular.

Respuesta correcta: 3. Bloquea la síntesis de ergosterol.